Desde la perspectiva de la gestión sanitaria, ¿a qué corresponden las iniciales GRD?:
1. Una red internacional de radiodiagnóstico basado en la telerradiología.
2. Los informes en línea que proporciona el sistema avanzado de información de algunos hospitales, sobre las previsiones de disponibilidad de camas, quirófanos y pruebas diagnósticas de alta tecnología.
3. Un informe elaborado por el Ministerio de Sanidad, en el que se recogen las conclusiones de un panel de expertos, que recomienda estrategias sobre Tecnología de la Información y de las Comunicaciones.
4. Un organismo, dependiente de la Organización Mundial de la Salud especializado en sistemas de información sanitaria.
5. Un sistema de clasificación de pacientes con episodios de hospitalización.

Respuesta correcta: 5. Un sistema de clasificación de pacientes con episodios de hospitalización.